下列有關雙硫鍵（disulfide bond）的敘述，何者錯誤？
A. 甲硫胺酸（methionine）側鏈的硫原子可參與雙硫鍵的形成
B. 蛋白質中的雙硫鍵會在強還原劑的作用下發生斷裂
C. 蛋白質中的雙硫鍵可增加其結構的熱穩定性
D. 雙硫鍵異構酶（disulfide isomerase）可幫助蛋白質摺疊

正確答案：A. 甲硫胺酸（methionine）側鏈的硫原子可參與雙硫鍵的形成